Clinical trial exclusion criterion:
Signs of hemodynamic instability (i.e. systolic blood pressure <100 mm Hg.St. or episode of systolic blood pressure fall for =40 mm Hg. / or heart rate > 110 lasting more than 15 min) or need for ventilatory support within 12 hours prior to randomisation.

Annotated entities:
- Condition: "hemodynamic instability"
- Measurement: "systolic blood pressure"
- Value: "<100 mm Hg.St."
- Measurement: "systolic blood pressure fall"
- Value: "=40 mm Hg"
- Measurement: "heart rate"
- Value: "> 110"
- Multiplier: "lasting more than 15 min"
- Procedure: "ventilatory support"
- Mood: "need for"
- Temporal: "within 12 hours prior to randomisation"